Clinical trial exclusion criterion:
Need to continue clopidogrel due to stroke, peripheral disease, significant carotid disease or recent acute coronary syndrome

Entity relations:
- Has_temporal("acute coronary syndrome", "recent")
- Has_qualifier("carotid disease", "significant")
- Has_mood("continue", "Need to")
- Has_multiplier("clopidogrel", "continue")
- AND("clopidogrel", "stroke")
- OR("stroke", "acute coronary syndrome", "peripheral disease", "carotid disease")